Clinical trial exclusion criterion:
Morbidly obese patients (BMI >47 kg/m2) and overweight/lean patients (BMI <27 kg/m2)

Entity relations:
- Has_value("BMI", ">47 kg/m2")
- Has_value("BMI", "<27 kg/m2")
- Subsumes("Morbidly obese", "BMI")
- Subsumes("overweight", "BMI")
- OR("overweight", "lean")
- OR("Morbidly obese", "overweight")